Women of child-bearing potential (WCBP) must have a negative serum pregnancy test 72 hours or less prior to starting treatment

The above is a clinical trial inclusion criterion. Annotated with entity spans:
[Pregnancy_considerations: Women of child-bearing potential (WCBP) must have a negative serum pregnancy test 72 hours or less prior to starting treatment]